Clinical trial exclusion criterion:
Past history of hypersensitivity to aripiprazole

Annotated entities:
- Condition: "hypersensitivity"
- Drug: "aripiprazole"